下列有關小兒巨腸症（megacolon）的敘述，何者錯誤？
A. 75%～80%侵犯直腸-乙狀結腸（rectosigmoid colon）
B. 最大死因：腸炎（enterocolitis）
C. 直腸切片檢查中，看不到神經節細胞（aganglion），乙醯膽鹼酶（acetylcholinesterase）染色也減少
D. 為避免檢查誤差，下消化道鋇劑檢查前應避免灌腸

正確答案：C. 直腸切片檢查中，看不到神經節細胞（aganglion），乙醯膽鹼酶（acetylcholinesterase）染色也減少